下列關於病毒性傳染病的主要地理分布，何者錯誤？
A. 北美洲的 west nile encephalitis
B. 東南亞的 Japanese encephalitis
C. 東南亞的 dengue fever
D. 南美洲的 Ebola virus infection

正確答案：D. 南美洲的 Ebola virus infection